Vaccination against pneumococcal infection in anamnesis;

The above is a clinical trial exclusion criterion. Annotated with entity spans:
[Procedure: Vaccination] against [Condition: pneumococcal infection] in anamnesis;